Clinical trial exclusion criterion:
severe renal impairment

Annotated entities:
- Qualifier: "severe"
- Condition: "renal impairment"